Clinical trial inclusion criterion:
Fulfills NIH criteria for bariatric surgery

Entity relations:
- Has_value("NIH criteria", "Fulfills")
- AND("bariatric surgery", "NIH criteria")